Signed informed consent prior to surgery

The above is a clinical trial inclusion criterion. Annotated with entity spans:
[Informed_consent: Signed informed consent prior to surgery]